Clinical trial exclusion criterion:
History or presence of clinically important hepatic or renal disease or other medical disease.

Entity relations:
- Has_temporal("clinically important renal disease", "History")
- OR("clinically important renal disease", "clinically important other medical disease", "clinically important hepatic disease")